Clinical trial exclusion criterion:
The patients who have more than or equal to 3 target lesions

Entity relations:
- Has_multiplier("target lesions", "more than or equal to 3")